Which R package has been developed for MS-based label-free phosphoproteomics?

Phosphonormalizer is an R package for MS-based label-free phosphoproteomics based on mass spectrometry-based normalization. It scales the peptide abundances to have the same median intensities, based on an assumption that the majority of abundances remain the same across the samples.